Clinical trial exclusion criterion:
Use of other products intended for weight loss including prescription drugs, over-the-counter (OTC) drugs, and herbal preparations within 1 month before Screening

Entity relations:
- Has_index("within 1 month before Screening", "Screening")
- Has_qualifier("products intended for weight loss", "prescription")
- Has_temporal("products intended for weight loss", "within 1 month before Screening")
- OR("prescription", "over-the-counter (OTC)", "herbal")